Clinical trial exclusion criterion:
6. Have a history of serious adverse gastrointestinal events (i.e., bleeding or perforation),history of a coagulopathy or current anti-coagulant use.

Annotated entities:
- Temporal: "history"
- Condition: "adverse gastrointestinal events"
- Qualifier: "serious"
- Condition: "bleeding"
- Condition: "perforation"
- Condition: "coagulopathy"
- Temporal: "history"
- Drug: "anti-coagulant"
- Temporal: "current"